下列何者分隔坐骨大切迹（greater sciatic notch）與坐骨小切迹（lesser sciatic notch）？
A. 髂後下棘（posterior inferior iliac spine）
B. 坐骨棘（ischial spine）
C. 坐骨粗隆（ischial tuberosity）
D. 恥骨結節（pubic tubercle）

正確答案：B. 坐骨棘（ischial spine）